Anaphylactic reaction to neomycin

The above is a clinical trial exclusion criterion. Annotated with entity spans:
[Condition: Anaphylactic reaction] to [Drug: neomycin]